¿Respecto a qué problemas psicológicos son más elevadas las correlaciones entre los distintos informantes consultados en evaluación infantil?
1. Problemas interiorizados.
2. Problemas de conducta.
3. Problemas de personalidad.
4. Problemas de socialización.
5. En relación al inicio temporal e intensidad de los problemas informados.

Respuesta correcta: 2. Problemas de conducta.